La causa más frecuente de pérdida visual irreversible en el mundo occidental en personas de más de 50 años es:
1. Retinopatía diabética.
2. Glaucoma crónico simple.
3. Degeneración macular asociada a la edad.
4. Desprendimiento de retina.
5. Cataratas.

Respuesta correcta: 3. Degeneración macular asociada a la edad.